Clinical trial inclusion criterion:
2. No history of traumatic brain injury of sufficient severity to have resulted in medical attention (ascertained via the Ohio State University TBI Identification Questionnaire—OSU TBI-ID)

Annotated entities:
- Condition: "traumatic brain injury"
- Qualifier: "sufficient severity"
- Measurement: "Ohio State University TBI Identification Questionnaire—OSU TBI-ID"
- Negation: "No"
- Temporal: "history"
- Subjective_judgement: "sufficient severity"
- Value: "sufficient severity"